Known peripheral artery disease

The above is a clinical trial exclusion criterion. Annotated with entity spans:
Known [Condition: peripheral artery disease]